Clinical trial exclusion criterion:
History of convulsions

Entity relations:
- Has_temporal("convulsions", "History")